虛談（confabulation）代表個案最可能有下列何種精神障礙？
A. 思考（thought）障礙
B. 情緒（emotion）障礙
C. 記憶（memory）障礙
D. 語言（language）障礙

正確答案：C. 記憶（memory）障礙